What is caused by the ectopic expression of CTCF?

Enforced ectopic expression of CTCF inhibits cell growth in culture.